Clinical trial inclusion criterion:
Autoimmune Hemolytic anemia with clinical and biochemical evidence of hemolysis refractory to treatment, in relapse or steroids dependant

Annotated entities:
- Condition: "Autoimmune Hemolytic anemia"
- Mood: "biochemical evidence"
- Mood: "evidence clinical"
- Condition: "hemolysis"
- Qualifier: "refractory to treatment"
- Procedure: "treatment"
- Qualifier: "steroids dependant"
- Qualifier: "in relapse"
- Drug: "steroids"